¿Cuántos cromosomas tendría un varón con nulisomía para los cromosomas 17 y 18?
1. 43.
2. 45.
3. 44.
4. 42.
5. 40.

Respuesta correcta: 4. 42.